對於一位腎衰竭的病患，為緩解其股骨骨折產生的急性疼痛，下列何種藥物不適合？
A. remifentanil
B. codeine
C. meperidine
D. fentanyl

正確答案：C. meperidine